Clinical trial exclusion criterion:
Individuals taking over the counter memory enhancing or protecting medications (e.g. ginkgo biloba, vitamins) are not excluded.

Entity relations:
- Subsumes("over the counter memory enhancing medications", "ginkgo biloba")
- AND("over the counter memory enhancing medications", "over the counter memory protecting medications")
- OR("ginkgo biloba", "vitamins")